Clinical trial inclusion criterion:
Age 18-100 years

Entity relations:
- Has_value("Age", "18-100 years")